肺癌患者出現下列何種表徵時，仍可考慮接受根除性手術治療？
A. 咳血
B. 腫瘤侵犯造成上腔靜脈症候群（superior vena cava syndrome）
C. 腫瘤或淋巴腺壓迫造成聲帶麻痺、聲音沙啞
D. 惡性肋膜積水

正確答案：A. 咳血